Clinical trial exclusion criterion:
Dementia or otherwise impaired cognition

Entity relations:
- OR("Dementia", "impaired cognition")